Clinical trial exclusion criterion:
Donation of blood or blood products within 8 weeks prior to vaccination or during the three week study period following

Annotated entities:
- Procedure: "Donation of blood"
- Procedure: "Donation of blood products"
- Temporal: "within 8 weeks prior to vaccination"
- Reference_point: "vaccination"
- Temporal: "during the three week study period"
- Reference_point: "the three week study period"